Clinical trial exclusion criterion:
Implanted or irremovable metal in the body (including certain tattoos and permanent make-up)

Annotated entities:
- Device: "Implanted metal in the body"
- Device: "irremovable metal in the body"